一位 48 歲的小鎮男性在一次大客車車禍中腹部受傷，經 10 小時後被轉送至某大醫院急診，雖意識清醒，但因腹膜炎而接受緊急剖腹探查術，術中發現有橫結腸裂開、胰臟和胃挫傷，肝臟左葉裂傷，經修補肝臟裂傷後，血壓及心跳等仍不穩定，此時應如何處理裂開的結腸最妥當？
A. 直接修補裂口
B. 利用此裂口拉出大腸作成一個結腸造口
C. 直接修補裂口，再將近側之大腸拉出腹外作造口
D. 切除受傷之大腸節段及此裂口，並立即完成大腸大腸吻合

正確答案：B. 利用此裂口拉出大腸作成一個結腸造口